List the diseases that can be treated using Vedolizumab.

Ulcerative colitis and Crohn's disease are inflammatory bowel diseases that have been successfully treated with Vedolizumab, a gut-selective, anti-inflammatory monoclonal antibody.